History of recurrent respiratory infections (> 3 hospitalization in the last year)

The above is a clinical trial exclusion criterion. Annotated with entity spans:
[Temporal: History] of [Multiplier: recurrent] [Condition: respiratory infections] ([Multiplier: > 3] [Procedure: hospitalization] in the last year)